Clinical trial inclusion criterion:
No history of PPD allergic contact dermatitis, with a negative PPD patch test.

Entity relations:
- AND("allergic contact dermatitis", "PPD")
- Has_negation("allergic contact dermatitis", "No")
- Has_value("PPD patch test", "negative")
- Subsumes("PPD patch test", "allergic contact dermatitis")